En relación a la adrenalina es cierto que:
1. Produce contracciones uterinas.
2. Se utiliza en el tratamiento del shock anafiláctico.
3. Se utiliza junto a la ampicilina en situaciones de sepsis.
4. Está contraindicada en situaciones de parada cardíaca por su efecto.
5. Encapsulada se absorbe rápidamente por vía oral.

Respuesta correcta: 2. Se utiliza en el tratamiento del shock anafiláctico.